Clinical trial exclusion criterion:
Upper urinary tract deterioration

Annotated entities:
- Condition: "Upper urinary tract deterioration"